Clinical trial inclusion criterion:
Presence of measurable lesions (=10mm on spiral CT scan) subject to RECIST 1.1;

Annotated entities:
- Condition: "measurable lesions"
- Value: "=10mm"
- Procedure: "spiral CT scan"
- Qualifier: "RECIST 1.1"